La ruta de los fosfatos de pentosa produce:
1. NADH y acetil-CoA.
2. NADPH y ribosa-5-fosfato.
3. NADH y ribosa-5-fosfato.
4. Urea.
5. Ribulosa-1,5-bisfosfato.

Respuesta correcta: 2. NADPH y ribosa-5-fosfato.